Clinical trial inclusion criterion:
Scheduled back surgery

Entity relations:
- Has_mood("back surgery", "Scheduled")